Clinical trial exclusion criterion:
stimulant medications (eg, Ritalin, Concerta, Biphetamine, and Dexedrine)

Annotated entities:
- Drug: "stimulant medications"
- Drug: "Ritalin"
- Drug: "Concerta"
- Drug: "Biphetamine"
- Drug: "Dexedrine"